Clinical trial inclusion criterion:
Medical Stability

Annotated entities:
- Condition: "Medical Stability"